History of hypersensitivity or allergy to any of the study drugs, drugs of similar chemical classes, ACE inhibitors (ACEIs), angiotensin II receptor blockers (ARBs), or neprilysin inhibitors, as well as known or suspected contraindications to the study drugs.

The above is a clinical trial exclusion criterion. Annotated with entity spans:
History of [Condition: hypersensitivity] or [Condition: allergy] to any of the [Drug: study drugs], d[Non-representable: rugs of similar chemical classes], [Drug: ACE inhibitors (ACEIs)], [Drug: angiotensin II receptor blockers (ARBs)], or [Drug: neprilysin inhibitors], as well as [Mood: known] or [Mood: suspected] [Condition: contraindications] to the [Drug: study drugs].